Patient treated with corticosteroids within 2 weeks before study inclusion.

The above is a clinical trial exclusion criterion. Annotated with entity spans:
Patient treated with [Drug: corticosteroids] [Temporal: within 2 weeks before study inclusion].